Renal dialysis

The above is a clinical trial exclusion criterion. Annotated with entity spans:
[Procedure: Renal dialysis]